60歲丁先生，由於勃起時硬度夠，但無法持久而來就診，陰莖海綿體血流量檢查發現其海綿體動脈血流正常，但有靜脈溢漏（venous leakage ）現象，最可能的病因是：
A. 陰莖海綿體神經病變
B. 良性前列腺肥大
C. 陰莖海綿體平滑肌病變
D. 尿道炎

正確答案：C. 陰莖海綿體平滑肌病變